The second early induction start criteria is in addition to the listed above, the percentage of the blasts on the level >10% on 7th day.

The above is a clinical trial inclusion criterion. Annotated with entity spans:
The second early induction start criteria is in addition to the listed above, the [Measurement: percentage of the blasts] on the level [Value: >10%] [Temporal: on 7th day].